Clinical trial exclusion criterion:
uncontrolled diabetes

Annotated entities:
- Qualifier: "uncontrolled"
- Condition: "diabetes"